What disease is associated with Anticitrullinated peptide antibodies (ACPAs)?

Anticitrullinated protein antibodies are found in patients with rheumatoid arthritis